Clinical trial exclusion criterion:
Infection with hepatitis C Virus

Entity relations:
- Has_qualifier("Infection", "hepatitis C Virus")